Clinical trial inclusion criteria:
Age > 40 years (45)
Primary knee osteoarthritis diagnosed using the American College of Rheumatology criteria (46)
Undergoing elective, primary and unilateral total knee arthroplasty
American Society of Anesthesiology (ASA) physical status class 1-3
BMI < 40 kg/m2

Annotated entities:
- Person: "Age"
- Value: "> 40 years"
- Condition: "Primary knee osteoarthritis"
- Qualifier: "American College of Rheumatology criteria"
- Procedure: "total knee arthroplasty"
- Qualifier: "unilateral"
- Qualifier: "primary"
- Qualifier: "elective"
- Measurement: "American Society of Anesthesiology physical status class"
- Value: "1-3"
- Measurement: "ASA"
- Measurement: "BMI"
- Value: "< 40 kg/m2"